Inability or unwilling to give informed consent

The above is a clinical trial exclusion criterion. Annotated with entity spans:
[Informed_consent: Inability or unwilling to give informed consent]